Clinical trial inclusion criteria:
Idiopathic Granulomatous Mastitis

Annotated entities:
- Condition: "Idiopathic Granulomatous Mastitis"